Clinical trial exclusion criterion:
Has received depot antipsychotic medication within one cycle prior to screening.

Entity relations:
- Has_temporal("depot antipsychotic medication", "within one cycle prior to screening")
- Has_index("within one cycle prior to screening", "screening")